Clinical trial inclusion criterion:
Patients are of American Society of Anesthesiologists (ASA) physical status I and II, aged 8-14 years old, of both gender, with suspected acute appendicitis scheduled for laparoscopic appendicectomy.

Entity relations:
- Has_value("American Society of Anesthesiologists physical status", "I and II")
- Has_value("aged", "8-14 years old")
- Has_mood("laparoscopic appendicectomy", "scheduled for")
- Has_mood("acute appendicitis", "suspected")
- AND("acute appendicitis", "laparoscopic appendicectomy")